Current diagnosis of major depressive disorder (DSM-IV-TR), single episode, recurrent or chronic, without psychotic features, as detected by MINI and clinical exam.

The above is a clinical trial inclusion criterion. Annotated with entity spans:
Current diagnosis of [Condition: major depressive disorder] ([Procedure: DSM-IV-TR]), [Multiplier: single episode], [Multiplier: recurrent] or [Multiplier: chronic], [Negation: without] [Condition: psychotic features], as detected by [Procedure: MINI] and [Procedure: clinical exam].